Clinical trial exclusion criterion:
Severe hyperlipidemia or severe disorders of lipid metabolism characterized by hypertriglyceridemia (serum triglyceride concentration >1,000 g/dL).

Entity relations:
- Has_qualifier("hyperlipidemia", "Severe")
- Has_qualifier("disorders of lipid metabolism", "severe")
- Has_value("serum triglyceride concentration", ">1,000 g/dL")
- Subsumes("hypertriglyceridemia", "serum triglyceride concentration")
- OR("hyperlipidemia", "disorders of lipid metabolism", "hypertriglyceridemia")